Clinical trial exclusion criterion:
Recent blood donation

Annotated entities:
- Observation: "blood donation"